Clinical trial exclusion criterion:
Allergy to acetazolamide and other sulfonamides.

Annotated entities:
- Condition: "Allergy"
- Drug: "acetazolamide"
- Drug: "sulfonamides"
- Qualifier: "other"